Baseline LIC >30 mg/g dw (measured by MRI);

The above is a clinical trial exclusion criterion. Annotated with entity spans:
[Temporal: Baseline] [Measurement: LIC] [Value: >30 mg/g] dw ([Mood: measured by] [Procedure: MRI]);